Clinical trial exclusion criterion:
Antihypertensives (<3 medications on a stable dose for ≥ 30 days);

Annotated entities:
- Drug: "Antihypertensives"
- Multiplier: "<3 medications"
- Qualifier: "stable dose"
- Temporal: "for ≥ 30 days"